Based on single or averaged corrected QT interval (QTc) values of triplicate electrocardiograms obtained over a brief recording period: QTcF < 450 msec

The above is a clinical trial inclusion criterion. Annotated with entity spans:
Based on [Qualifier: single] or [Qualifier: averaged] [Measurement: corrected QT interval (QTc)] values of triplicate [Procedure: electrocardiograms] obtained [Temporal: over a brief recording period]: [Measurement: QTcF] [Value: < 450 msec]